Clinical trial exclusion criterion:
Cyanotic heart disease (congenital or acquired)

Annotated entities:
- Condition: "Cyanotic heart disease"
- Qualifier: "congenital"
- Qualifier: "acquired"